Clinical trial inclusion criterion:
CICC placed in the internal jugular vein or subclavian vein position

Entity relations:
- Has_qualifier("CICC placed", "in the internal jugular vein position")
- OR("in the internal jugular vein position", "in the subclavian vein position")